Clinical trial exclusion criterion:
Evidence of recovering finger/thumb extension at 4-6 months

Entity relations:
- Has_qualifier("recovering extension", "finger")
- Has_temporal("recovering extension", "at 4-6 months")
- OR("finger", "thumb")